Clinical trial exclusion criterion:
GFR (MDRD) < 40 ml/min;

Annotated entities:
- Measurement: "GFR"
- Value: "< 40 ml/min"